Clinical trial exclusion criterion:
Women of child bearing potential unless they are using a birth control method

Entity relations:
- Has_negation("birth control method", "unless")